¿Cuál es la ecuación correcta que describe el potencial que se describe el potencial que se desarrolla en la superficie de un electrodo de ión selectivo?:
1. Van Deemter.
2. Van Slyke.
3. Nernst.
4. Henderson-Hasselbalch.

Respuesta correcta: 3. Nernst.